Teeth used are able to be isolated with rubber dam

The above is a clinical trial inclusion criterion. Annotated with entity spans:
[Non-representable: Teeth used are able to be isolated with rubber dam]